¿Qué autor propone que la estructura y funciones de la personalidad se organizan en tres niveles: rasgos disposicionales, intereses o preocupaciones personales e historia de vida?
1. Pelechano.
2. Cantor.
3. Costa.
4. McAdams.
5. Pervin.

Respuesta correcta: 4. McAdams.